Suspected cervical vertebral column injury necessitating using a neck collar.

The above is a clinical trial exclusion criterion. Annotated with entity spans:
[Mood: Suspected] [Condition: cervical vertebral column injury] necessitating using a neck collar.